下列那一鼻甲為一單獨的骨頭而非屬於篩骨的一部分？
A. 下鼻甲
B. 中鼻甲
C. 上鼻甲
D. 最高鼻甲

正確答案：A. 下鼻甲